Un hombre de 67 años, diagnosticado de cirrosis hepática y bebedor activo, ingresa por cuadro de distensión abdominal progresiva con malestar difuso, de dos semanas de evolución. No refiere fiebre ni otros síntomas. A la exploración destaca matidez cambiante a la percusión abdominal, con ausencia de edemas. Se realiza una paracentesis diagnóstica, encontrando un líquido ligeramente turbio, con 2300 células/mL, de las cuales 30% son linfocitos, 60% polimorfonucleares y 10% hematíes. ¿Cuál es la primera medida terapéutica que pautaría en este paciente de forma inmediata?
1. Restricción de sal y líquidos.
2. Tratamiento diurético con espironolactona oral.
3. Tratamiento con una cefalosporina de tercera generación.
4. Paracentesis evacuadora.

Respuesta correcta: 3. Tratamiento con una cefalosporina de tercera generación.